Clinical trial exclusion criterion:
Pregnancy or possible pregnancy at time of randomization, or female of child bearing potential who are lactating, or sexually active and not taking adequate contraceptive precautions (e.g., intrauterine device or oral contraceptives for 3 months prior to entry into the study)

Entity relations:
- Has_mood("pregnancy", "possible")
- Has_temporal("pregnancy", "at time of randomization")
- Has_index("at time of randomization", "time of randomization")
- Has_qualifier("contraceptive precautions", "adequate")
- Has_negation("contraceptive precautions", "not")
- Has_index("for 3 months prior to entry into the study", "entry into the study")
- Has_temporal("oral contraceptives", "for 3 months prior to entry into the study")
- Subsumes("contraceptive precautions", "intrauterine device")
- OR("Pregnancy", "pregnancy", "female", "sexually active")
- OR("intrauterine device", "oral contraceptives")